Clinical trial exclusion criterion:
unstable condition, COPD exacerbation

Annotated entities:
- Qualifier: "unstable"
- Condition: "condition"
- Condition: "COPD exacerbation"